下列關於結核病治療之敘述，何者正確？
A. 採用一週二到三次的高劑量療法，可以縮短療程，減少抗藥性
B. 曾接受過抗結核藥物治療，且服藥不規律者，發生抗藥性的機率高
C. 一旦罹患多重抗藥性，仍可使用標準藥物合併治療，於六個月內完治
D. 臺灣因為過去抗生素濫用，產生許多超級抗藥結核病（XDRTB），每年約占新結核病個案的 1 %，成為嚴重的公衛問題

正確答案：B. 曾接受過抗結核藥物治療，且服藥不規律者，發生抗藥性的機率高